What is iodine thyroid blocking?

High doses of potassium iodide are effective to block radioiodine thyroid uptake and to prevent development of thyroid cancer years later.